1. Angina or equivalent symptoms > 20 min and

The above is a clinical trial inclusion criterion. Annotated with entity spans:
1. [Condition: Angina] or equivalent symptoms [Temporal: > 20 min] and